Clinical trial exclusion criterion:
Having the other contraindications for Rosuvastatin;

Annotated entities:
- Condition: "contraindications"
- Drug: "Rosuvastatin"